Clinical trial exclusion criterion:
Subjects on chronic transfusion program

Entity relations:
- Has_qualifier("transfusion program", "chronic")
- multi("chronic", "chronic")